Drug-eluting stent implantation within 3 months prior to TAVI procedure;

The above is a clinical trial exclusion criterion. Annotated with entity spans:
[Device: Drug-eluting stent] [Procedure: implantation] [Temporal: within 3 months prior to TAVI procedure];